Clinical trial inclusion criterion:
Negative for HBsAg and for antibodies to HCV, HIV-1.

Annotated entities:
- Measurement: "HBsAg"
- Value: "Negative"
- Measurement: "antibodies to HCV"
- Measurement: "HIV-1"